Known HIV positivity

The above is a clinical trial exclusion criterion. Annotated with entity spans:
Known [Condition: HIV positivity]